Clinical trial exclusion criterion:
Documented life expectancy of less than 12 months

Annotated entities:
- Observation: "life expectancy"
- Value: "less than 12 months"